Patients with history of significant cardiac disease

The above is a clinical trial exclusion criterion. Annotated with entity spans:
Patients with [Temporal: history] of [Qualifier: significant] [Condition: cardiac disease]